Clinical trial exclusion criterion:
Any condition requiring antibiotics 14 days prior to arriving for surgery.

Entity relations:
- multi("arriving for surgery", "surgery")
- Has_index("14 days prior to arriving for surgery", "arriving for surgery")
- Has_temporal("antibiotics", "14 days prior to arriving for surgery")